Inability to attend follow up visits

The above is a clinical trial exclusion criterion. Annotated with entity spans:
[Condition: Inability] to [Observation: attend follow up visits]